Potentially unreliable subjects, and those judged by the investigator to be unsuitable for the study.

The above is a clinical trial exclusion criterion. Annotated with entity spans:
[Non-representable: Potentially] [Observation: unreliable subjects], and those [Non-representable: judged by the investigator] to be [Observation: unsuitable for the study].